Clinical trial exclusion criterion:
Hip dysplasia (center edge angle < 20° on AP radiograph)

Entity relations:
- Has_value("center edge angle", "< 20°")